En la curva de valoración de un ácido diprótico, los tres puntos cuyo pH solo depende de las constantes de disociación son:
1. El punto inicial y los puntos de equivalencia.
2. El primer punto de equivalencia y los dos puntos de semineutralización.
3. El primer punto de semineutralización y los dos puntos de equivalencia.
4. El punto inicial, el primer punto de semineutralización y el primer punto de equivalencia.
5. El punto inicial y los dos puntos de semineutralización.

Respuesta correcta: 2. El primer punto de equivalencia y los dos puntos de semineutralización.